Clinical trial exclusion criterion:
Pregnant women (women of childbearing potential will be advised to undergo regular pregnancy testing)

Annotated entities:
- Pregnancy_considerations: "Pregnant women (women of childbearing potential will be advised to undergo regular pregnancy testing)"